Patient can read and understand danish

The above is a clinical trial inclusion criterion. Annotated with entity spans:
[Non-query-able: Patient can read and understand danish]